Erectile dysfunction in the history or current medication for erectile dysfunction

The above is a clinical trial exclusion criterion. Annotated with entity spans:
[Condition: Erectile dysfunction] in the [Temporal: history] or [Temporal: current] [Drug: medication] for [Condition: erectile dysfunction]